Patients who have active infections requiring therapy.

The above is a clinical trial exclusion criterion. Annotated with entity spans:
Patients who have active [Condition: infections] [Qualifier: requiring therapy].